Clinical trial inclusion criterion:
Age range: 18-45 years

Annotated entities:
- Person: "Age"
- Value: "18-45 years"